Clinical trial inclusion criterion:
Lumpy or hard stools in =25% of defecations

Annotated entities:
- Observation: "hard stools"
- Observation: "Lumpy stools"
- Condition: "defecations"
- Multiplier: "=25%"